Clinical trial inclusion criterion:
Esophageal varices with high bleeding risk: more than F2 and red color sign

Entity relations:
- Has_context("Esophageal varices", "high bleeding risk")
- Has_multiplier("F2", "more than")
- AND("high bleeding risk", "F2")
- AND("high bleeding risk", "red color sign")